patients with severe left ventricle dysfunction with an ejection fraction (EF)=40%, being scheduled for revascularization.

The above is a clinical trial inclusion criterion. Annotated with entity spans:
patients with [Qualifier: severe] [Condition: left ventricle dysfunction] with an [Measurement: ejection fraction (EF)][Value: =40%], [Mood: being scheduled for] [Procedure: revascularization].